Clinical trial exclusion criterion:
Use of oral, injected or implanted hormonal methods of contraception or other forms of hormonal contraception that have comparable efficacy (failure rate <1%), for example hormone vaginal ring or transdermal hormone contraception

Annotated entities:
- Non-query-able: "Use of oral, injected or implanted hormonal methods of contraception or other forms of hormonal contraception that have comparable efficacy (failure rate <1%)"
- Procedure: "hormone vaginal ring"
- Procedure: "transdermal hormone contraception"